Clinical trial inclusion criterion:
1. Age: 18 years and older.

Annotated entities:
- Value: "18 years and older"
- Person: "Age"